Patients allergic to lidocaine or other local anesthetics;

The above is a clinical trial exclusion criterion. Annotated with entity spans:
Patients [Condition: allergic] to [Drug: lidocaine] or [Qualifier: other] [Drug: local anesthetics];